Clinical trial inclusion criterion:
Hemoglobin = 11 g/dL for female subjects; = 12 g/dL for male subjects.

Entity relations:
- Has_value("male", "= 12 g/dL")
- Has_value("female", "= 11 g/dL")
- AND("Hemoglobin", "female")
- OR("female", "male")